Clinical trial exclusion criterion:
Patients with a history of bladder cancer or patients with active bladder cancer

Annotated entities:
- Condition: "bladder cancer"
- Qualifier: "active"
- Condition: "bladder cancer"